Clinical trial exclusion criterion:
AST or ALT > 120

Entity relations:
- Has_value("AST", "> 120")
- OR("AST", "ALT")